Clinical trial inclusion criterion:
Those who weigh more than 40kg

Annotated entities:
- Measurement: "weigh"
- Value: "more than 40kg"